Clinical trial exclusion criterion:
With severe cardio-pulmonary dysfunction, such as left heart failure, unstable arrhythmia, etc.

Annotated entities:
- Condition: "cardio-pulmonary dysfunction"
- Qualifier: "severe"
- Condition: "left heart failure"
- Condition: "arrhythmia"
- Qualifier: "unstable"